Clinical trial exclusion criteria:
Women refusing HBs Ag test
HIV co-infection
HCV co-infection
HBV treatment ongoing at the day of inclusion
Creatinine clearance < 30 mL/min
Severe gravidic disease present at inclusion involving life threatening to the mother and/or the child
Evidence of pre-existing fetal anomalies incompatible with the child's life
Imminent child's birth defined as cervix dilatation up to 7 centimeters
Intention to deliver in a maternity not linked to the study
Any concomitant medical condition that, according to the clinical site investigator would contraindicate participation in the study.
Concurrent participation in any other clinical trial without written agreement of the two study teams

Annotated entities:
- Measurement: "HBs Ag test"
- Negation: "refusing"
- Condition: "co-infection"
- Qualifier: "HIV"
- Condition: "co-infection"
- Qualifier: "HCV"
- Procedure: "HBV treatment"
- Measurement: "Creatinine clearance"
- Value: "< 30 mL/min"
- Condition: "gravidic disease"
- Qualifier: "Severe"
- Qualifier: "life threatening"
- Condition: "fetal anomalies"
- Condition: "Imminent child's birth"
- Measurement: "cervix dilatation"
- Value: "7 centimeters"
- Post-eligibility: "Intention to deliver in a maternity not linked to the study"
- Post-eligibility: "Any concomitant medical condition that, according to the clinical site investigator would contraindicate participation in the study"
- Competing_trial: "Concurrent participation in any other clinical trial without written agreement of the two study teams"